對於「胸腺（thymus）」之敘述，下列何者正確？
A. 同時具有輸入和輸出淋巴管
B. 是 T-淋巴球（T-lymphocyte）成熟位置
C. 主要功能為過濾淋巴液
D. 老年人具發達之胸腺

正確答案：B. 是 T-淋巴球（T-lymphocyte）成熟位置